Clinical trial inclusion criterion:
Be healthy on the basis of clinical laboratory tests performed at Screening. If the results of the serum chemistry panel [including liver enzymes], hematology, or urinalysis are outside the normal reference ranges, the participant may be included only if the investigator judges the abnormalities or deviations from normal to be not clinically significant. This determination must be recorded in the participants' source documents and initialed by the investigator

Annotated entities:
- Procedure: "clinical laboratory tests"
- Temporal: "performed at Screening"
- Reference_point: "at Screening"
- Undefined_semantics: "clinical laboratory tests"
- Condition: "healthy"
- Measurement: "serum chemistry panel"
- Measurement: "liver enzymes"
- Measurement: "hematology"
- Procedure: "urinalysis"
- Value: "outside the normal reference range"
- Subjective_judgement: "the investigator judges"
- Subjective_judgement: "not clinically significant"
- Not_a_criteria: "This determination must be recorded in the participants' source documents and initialed by the investigator"